El síndrome aórtico agudo incluye entidades como la disección aórtica, el hematoma intramural aórtico y la úlcera aterosclerótica penetrante. Respecto a las consideraciones diagnósticas y terapéuticas de esta entidad, señale la afirmación CORRECTA:
1. Actualmente, en nuestro medio, el diagnóstico de esta patología se establece rutinariamente      mediante      arteriografía percutánea.
2. La tomografía computarizada no es una buena técnica de imagen para su diagnóstico.
3. Las técnicas ecocardiográficas no suelen aportar datos de interés en el diagnóstico y estudio de estas entidades nosológicas.
4. Se considera disección o hematoma intramural aórtico tipo A de Stanford cuando está afectada la aorta ascendente sea cual fuese el lugar de origen de la lesión o su extensión.
5. La indicación quirúrgica de una disección aórtica es independiente de la afectación de la aorta ascendente.

Respuesta correcta: 4. Se considera disección o hematoma intramural aórtico tipo A de Stanford cuando está afectada la aorta ascendente sea cual fuese el lugar de origen de la lesión o su extensión.